Consumption of daily medications that alter glucose metabolism of GI function (glucocorticoids, psychotropics, narcotics, metoclopramide)

The above is a clinical trial exclusion criterion. Annotated with entity spans:
Consumption of [Multiplier: daily] [Drug: medications] [Qualifier: that alter glucose metabolism of GI function] ([Drug: glucocorticoids], [Drug: psychotropics], [Drug: narcotics], [Drug: metoclopramide])